肝醣合成酶（glycogen synthase）可被下列何種反應直接活化？
A. 肝醣合成酶激酶 3（Glycogen synthase kinase 3）在肝醣合成酶之特定胺基酸上作磷化反應
B. 酪蛋白激酶Ⅱ（Casein kinase Ⅱ）在肝醣合成酶之特定胺基酸上作磷化反應
C. 磷蛋白磷酸水解酶第一型（Phosphoprotein phosphatase 1）將肝醣合成酶分子中多個位置作去磷化反應
D. 在胰高血糖激素（glucagon）存在下

正確答案：C. 磷蛋白磷酸水解酶第一型（Phosphoprotein phosphatase 1）將肝醣合成酶分子中多個位置作去磷化反應